Clinical trial inclusion criterion:
Have diagnosed COPD stage III or IV according to GOLD criteria: a baseline post-bronchodilator Forced Expiratory Volume, measured at 1 second (FEV1) <50% of predicted normal and a baseline post- bronchodilator FEV1/Inspiratory Vital Capacity (IVC) ratio <70%.

Annotated entities:
- Condition: "COPD"
- Value: "stage III or IV"
- Measurement: "GOLD criteria"
- Measurement: "Forced Expiratory Volume, measured at 1 second (FEV1)"
- Value: "<50% of predicted normal"
- Temporal: "post-bronchodilator"
- Temporal: "post- bronchodilator"
- Measurement: "FEV1/Inspiratory Vital Capacity (IVC) ratio"
- Value: "<70%"